What is an approximate number of CTCF binding sites in the human genome?

The number of CTCF binding sites in the human genome lies between 31,000 and 50,000.